有關良性骨病灶及其相關治療的敘述，下列何者錯誤？
A. 單純性骨囊腫（simple bone cyst）的治療包括：追蹤觀察、限制活動、病灶內類固醇注射、病灶內刮除及
B. 動脈瘤性骨囊腫（aneurysmal bone cyst）的治療包括：活體組織切片（biopsy）加以確診、刮除
C. 骨樣骨瘤（osteoid osteoma）的局部疼痛，可用非類固醇抗發炎藥物（nonsteroidal anti-inflammatory drugs）來緩解
D. 侵犯到脊椎體之嗜伊紅球性肉芽腫（eosinophilic granuloma），需要執行開放性刮除手術（open

正確答案：D. 侵犯到脊椎體之嗜伊紅球性肉芽腫（eosinophilic granuloma），需要執行開放性刮除手術（open